Clinical trial inclusion criterion:
Nursing homes will be eligible to participate if they meet the following criteria:

Annotated entities:
- Visit: "Nursing homes"